Clinical trial exclusion criterion:
Any carotid stenting or endarterectomy

Annotated entities:
- Device: "carotid stenting"
- Procedure: "endarterectomy"